Clinical trial exclusion criterion:
Contact lens-wear during study

Entity relations:
- Has_temporal("Contact lens-wear", "during study")